Patients with severe uncontrolled hypertension with systolic BP > 220mmHg or diastolic BP > 120mmHg;

The above is a clinical trial exclusion criterion. Annotated with entity spans:
Patients with [Qualifier: severe] [Qualifier: uncontrolled] [Condition: hypertension] with [Measurement: systolic BP] [Value: > 220mmHg] or [Measurement: diastolic BP] [Value: > 120mmHg];